Clinical trial inclusion criterion:
Patients are diagnosed with T2DM for at least the last 6 months.

Entity relations:
- Has_temporal("T2DM", "for at least the last 6 months")